What is the human RCA locus size in bps?

The human RCA locus is located on chromosome 1 (CA1) and consists of approximately 750 kb.